What are the end products of the shikimate pathway?

The shikimate pathway responsible for the generation of aromatic amino acids